Clinical trial exclusion criterion:
Preoperative renal failure (defined as a serum creatinine > 2.0 mg/dL.)

Entity relations:
- Has_temporal("renal failure", "Preoperative")
- Has_value("serum creatinine", "> 2.0 mg/dL")
- Subsumes("renal failure", "serum creatinine")